Clinical trial inclusion criteria:
Diagnosed Iron deficiency anemia.
H-pylori positive cases.
Second trimester pregnancy.

Annotated entities:
- Condition: "Iron deficiency anemia"
- Condition: "H-pylori positive"
- Qualifier: "Second trimester"
- Condition: "pregnancy"
- Temporal: "Second trimester"